Clinical trial inclusion criterion:
ASA I, II, III presenting for ambulatory surgery to be performed under general anesthesia

Entity relations:
- Has_value("ASA", "I")
- multi("under general anesthesia", "general anesthesia")
- Has_qualifier("ambulatory surgery", "under general anesthesia")
- OR("I", "II", "III")